Clinical trial exclusion criterion:
Patients with any peripheral neuropathy or unresolved diarrhea greater than Grade 1

Annotated entities:
- Condition: "peripheral neuropathy"
- Condition: "unresolved diarrhea"
- Measurement: "Grade"
- Value: "greater than 1"